Clinical trial exclusion criterion:
Patient with an esophageal location of scleroderma

Entity relations:
- Has_qualifier("scleroderma", "esophageal location")